對於肺癌手術，下列何者不是必要的檢查？
A. 肺功能檢查
B. 正子攝影（positron emission tomography, PET）檢查
C. 腦血管攝影檢查
D. 胸部CT檢查

正確答案：C. 腦血管攝影檢查